Clinical trial exclusion criterion:
myopia of > or = to 8 diopters.

Entity relations:
- Has_value("myopia", "> or = to 8 diopters")